Clinical trial exclusion criterion:
Patients with severe heart disease history, including ventricular tachycardia (VT), atrial fibrillation (AF), heart block, myocardial infarction (MI), congestive heart failure (CHF), coronary heart disease patients needed therapy;

Entity relations:
- Has_qualifier("heart disease", "severe")
- Subsumes("ventricular tachycardia", "VT")
- Subsumes("atrial fibrillation", "AF")
- Subsumes("myocardial infarction", "MI")
- Subsumes("congestive heart failure", "CHF")
- Subsumes("heart disease", "ventricular tachycardia")
- OR("ventricular tachycardia", "atrial fibrillation", "heart block", "myocardial infarction", "congestive heart failure", "coronary heart disease")